General danger signs or symptoms of severe malaria

The above is a clinical trial exclusion criterion. Annotated with entity spans:
General danger signs or symptoms of [Qualifier: severe] [Condition: malaria]